Active AS assessed by total Bath Ankylosing Spondylitis Disease Activity index (BASDAI) = 4 (0-10) at baseline

The above is a clinical trial inclusion criterion. Annotated with entity spans:
[Qualifier: Active] [Condition: AS] assessed by [Measurement: total Bath Ankylosing Spondylitis Disease Activity index (BASDAI)] [Value: = 4] (0-10) [Temporal: at baseline]